肺韌帶（pulmonary ligament）位於肺臟何處？
A. 尖端（apex）
B. 基底面（base）
C. 肋骨面（costal surface）
D. 根部（root）

正確答案：D. 根部（root）